Use of other products intended for weight loss including prescription drugs, over-the-counter (OTC) drugs, and herbal preparations within 1 month before Screening

The above is a clinical trial exclusion criterion. Annotated with entity spans:
Use of other [Drug: products intended for weight loss] including [Qualifier: prescription] drugs, [Qualifier: over-the-counter (OTC)] drugs, and [Qualifier: herbal] preparations [Temporal: within 1 month before Screening]